Clinical trial inclusion criterion:
Diagnosed hepato-biliary disease/inflammation

Entity relations:
- OR("hepato-biliary disease", "hepato-biliary inflammation")